引起低鉀血症（hypokalemia）的原因，不包括下列何者？
A. 腹瀉
B. 持續嘔吐
C. 服用 spironolactone
D. 醛固酮過多症（hyperaldosteronism）

正確答案：C. 服用 spironolactone